Clinical trial inclusion criterion:
Laboratory urine culture: <103 CFUs

Entity relations:
- Has_value("Laboratory urine culture", "<103 CFUs")